Clinical trial exclusion criterion:
untreaed hyperprolactinemia

Annotated entities:
- Qualifier: "untreaed"
- Condition: "hyperprolactinemia"